Clinical trial exclusion criterion:
Currently enrolled in another clinical study or has used any investigational drug or device within 30 days before providing informed consent

Annotated entities:
- Observation: "enrolled in clinical study"
- Qualifier: "another"
- Temporal: "Currently"
- Drug: "investigational drug"
- Temporal: "within 30 days before providing informed consent"
- Device: "device"